下列何種鎮靜安眠藥物，可以經由靜脈注射的方式用於外科手術前的誘導作用？
A. thiopental
B. amobarbital
C. secobarbital
D. pentobarbital

正確答案：A. thiopental